Clinical trial inclusion criteria:
Healthy male volunteers, 18 to 45 years of age, inclusive. Healthy status is defined by absence of evidence of any active or chronic disease following a detailed medical and surgical history, a complete physical examination including vital signs, 12-lead ECG, hematology, blood chemistry, serology and urinalysis
Body mass index (BMI) 18 to 30 kg/m2 inclusive
Male subjects (whether surgically sterilized or not) with female partners of child-bearing potential must use two forms of contraception, one of which must be a barrier method, for the duration of the study and for 77 days after the last dose

Annotated entities:
- Condition: "Healthy"
- Person: "male"
- Value: "18 to 45 years , inclusive"
- Person: "age"
- Negation: "absence"
- Observation: "evidence of any active or chronic disease"
- Temporal: "medical history"
- Temporal: "surgical history"
- Procedure: "physical examination"
- Procedure: "vital signs"
- Procedure: "12-lead ECG"
- Procedure: "hematology"
- Procedure: "blood chemistry"
- Procedure: "serology"
- Procedure: "urinalysis"
- Measurement: "Body mass index (BMI)"
- Value: "18 to 30 kg/m2 inclusive"
- Person: "Male"
- Condition: "surgically sterilized"
- Condition: "surgically sterilized"
- Negation: "not"
- Person: "female"
- Condition: "child-bearing potential"
- Multiplier: "two"
- Device: "forms of contraception"
- Undefined_semantics: "forms of contraception"
- Device: "barrier method"
- Temporal: "for the duration of the study"
- Temporal: "for 77 days after the last dose"
- Reference_point: "the last dose"
- Reference_point: "the study"